Clinical trial inclusion criterion:
Children aging between 3 and 6 years

Annotated entities:
- Person: "Children"
- Person: "aging"
- Value: "between 3 and 6 years"